Which bacteria caused plague?

Yersinia pestis is the causative bacteria of the plague.